Clinical trial inclusion criterion:
Lobar and sublobar resections

Entity relations:
- OR("Lobar resections", "sublobar resections")